Clinical trial exclusion criterion:
being <50% breastfed at the time of inclusion

Annotated entities:
- Multiplier: "<50%"
- Observation: "breastfed"
- Temporal: "at the time of inclusion"